下列有關大腦白質的敘述，何者錯誤？
A. cingulum 含有 association fibers
B. corpus callosum 含有 commissural fibers
C. uncinate fasciculus 連接大腦額葉與顳葉
D. Meyer's loop 傳導聽覺訊息

正確答案：D. Meyer's loop 傳導聽覺訊息